Clinical trial exclusion criterion:
Pregnancy (present, suspected, or planned)

Entity relations:
- Has_temporal("Pregnancy", "present")
- OR("present", "planned", "suspected")